Clinical trial exclusion criterion:
Previous pars plana vitrectomy in the study eye

Annotated entities:
- Temporal: "Previous"
- Procedure: "pars plana vitrectomy"
- Qualifier: "in the study eye"